一位 45 歲男性，於二年前發現有大腸癌，為 Duke B1 期，接受手術切除，病理診斷為腺癌，今年例行檢查時發現右上肺葉有一個 2 × 2 公分轉移病灶，病理切片亦為腺癌，經正子掃描並未發現其他地方轉移，該病患之處置，下列何者最為適當？
A. 化學治療
B. 放射治療
C. 手術治療
D. 化學治療合併放射治療

正確答案：C. 手術治療